女性陰道發育時如發生 Defective canalization 時可能會有下列何種結果？
A. 陰道縱向中隔
B. 陰道橫向中隔
C. 處女膜閉鎖
D. 子宮內膜中隔

正確答案：B. 陰道橫向中隔